La desnaturalización de proteínas:
1. Altera la conformación nativa sin afectar la actividad biológica.
2. Siempre es irreversible.
3. Únicamente se puede conseguir mediante tratamiento con ácidos fuertes.
4. No afecta la estructura primaria.
5. Produce la hidrólisis de la proteína.

Respuesta correcta: 4. No afecta la estructura primaria.